Clinical trial inclusion criterion:
prospectively with an EDSS change of at least 1.0 points over the last two years, or

Entity relations:
- Has_value("EDSS change", "at least 1.0 points")
- Has_temporal("EDSS change", "over the last two years")